對於五歲以下小孩，其氣道最狹窄部位為何？
A. tongue base
B. vocal cords
C. cricoid cartilage
D. thyroid cartilage

正確答案：C. cricoid cartilage